Clinical trial exclusion criterion:
stroke or other cardioembolic event within the 30 days prior to the scheduled procedure;

Annotated entities:
- Condition: "stroke"
- Qualifier: "other"
- Condition: "cardioembolic event"
- Temporal: "within the 30 days prior to the scheduled procedure"
- Reference_point: "the scheduled procedure"